已經生育過的54歲婦女，因為停經後出血，如果臨床懷疑有子宮內膜病變的可能，下列何處置最能正確診斷病灶？
A. 陰道及子宮頸抹片（Pap smear）
B. 經陰道超音波（transvaginal ultrasound）
C. 門診子宮內膜吸取取樣（office endometrial aspiration biopsy）
D. 子宮頸擴張及刮搔術或子宮鏡（dilation and curettage or hysteroscopy）

正確答案：D. 子宮頸擴張及刮搔術或子宮鏡（dilation and curettage or hysteroscopy）